Clinical trial exclusion criterion:
No history of using 5-ASA, biological or immunomodulatory therapy

Annotated entities:
- Negation: "No"
- Temporal: "history"
- Drug: "5-ASA"
- Procedure: "therapy biological"
- Procedure: "immunomodulatory therapy"